Type I or II diabetes

The above is a clinical trial exclusion criterion. Annotated with entity spans:
[Condition: Type I] or II diabetes